65歲男性，主訴為右上臉頰及眼皮出現成群疼痛的水疱，下列那一種檢查可幫助診斷？
A. Tzanck抹片檢查（Tzanck smear）
B. 伍氏燈（Wood's light）檢查
C. 貼膚試	（patch test）
D. KOH鏡檢

正確答案：A. Tzanck抹片檢查（Tzanck smear）